Clinical trial exclusion criterion:
Alcohol or illicit drug use, which in the investigators opinion may affect participation in study.

Annotated entities:
- Observation: "Alcohol use"
- Observation: "illicit drug use"